Diabetes mellitus or other systemic illness

The above is a clinical trial exclusion criterion. Annotated with entity spans:
[Condition: Diabetes mellitus] or other [Condition: systemic illness]